Live donor transplantation scheduled within 6 months

The above is a clinical trial exclusion criterion. Annotated with entity spans:
[Procedure: Live donor transplantation] [Mood: scheduled] [Temporal: within 6 months]